Clinical trial exclusion criterion:
Patient has been permanently discontinued from nilotinib treatment in the parent study due to unacceptable toxicity, non-compliance to study procedures, withdrawal of consent or any other reason

Entity relations:
- Has_multiplier("discontinued", "permanently")
- AND("treatment", "nilotinib")
- Has_negation("treatment", "discontinued")
- AND("non-compliance", "study procedures")
- Has_negation("consent", "withdrawal")
- AND("treatment", "unacceptable toxicity")
- OR("unacceptable toxicity", "any other reason", "non-compliance", "consent")